Clinical trial exclusion criterion:
Unresectable tumor during operation

Annotated entities:
- Condition: "Unresectable tumor"